¿Cuál de las siguientes características NO es típica de los contenidos de las ideas obsesivas?
1. Pensamientos sexuales.
2. Fonemas.
3. Necesidad de simetría.
4. Duda patológica.
5. Contaminación.

Respuesta correcta: 2. Fonemas.